Patients with percutaneous gastric or jejunal feeding tubes already in situ as per Health Canada guidance;

The above is a clinical trial exclusion criterion. Annotated with entity spans:
Patients with percutaneous [Device: gastric] or [Device: jejunal feeding tubes] already in situ as per Health Canada guidance;